Clinical trial exclusion criterion:
Heavy alcoholics

Entity relations:
- Has_qualifier("alcoholics", "Heavy")